Clinical trial exclusion criterion:
choroidal neovascularization caused by other eye diseases

Entity relations:
- causal("choroidal neovascularization", "other eye diseases")
- multi("other eye diseases", "other")